Age 60 years or older.

The above is a clinical trial inclusion criterion. Annotated with entity spans:
[Person: Age] [Value: 60 years or older].